Clinical trial inclusion criterion:
History of scleroderma

Entity relations:
- Has_temporal("scleroderma", "History")